Según la teoría del aprendizaje social de J.B. Rotter, tanto las expectativas generales como las específicas son:
1. Metas u objetivos.
2. Predisposiciones innatas.
3. Juicios o creencias.
4. Probabilidades objetivas.
5. Incentivos o reforzadores.

Respuesta correcta: 3. Juicios o creencias.